Clinical trial exclusion criterion:
Organic mental disease, including mental retardation.

Entity relations:
- Subsumes("Organic mental disease", "mental retardation")